ASIA A, B,C and D

The above is a clinical trial inclusion criterion. Annotated with entity spans:
[Measurement: ASIA] [Value: A, B,C and D]